Clinical trial exclusion criterion:
5. Agents affecting gastric emptying (Motilium®, Prandase®, Victoza®, Byetta® and Symlin®) as well as oral anti-diabetic agents (Metformin, SGLT-2 inhibitors and DPP-4 inhibitors) if not at a stable dose for 3 months. Otherwise, these medications are acceptable and will be kept stable during the entire protocol.

Entity relations:
- Subsumes("Agents affecting gastric emptying", "Motilium")
- Subsumes("oral anti-diabetic agents", "Metformin")
- Has_temporal("stable dose", "for 3 months")
- Has_negation("stable dose", "not")
- Has_qualifier("oral anti-diabetic agents", "stable dose")
- Subsumes("Agents affecting gastric emptying", "and")
- Subsumes("oral anti-diabetic agents", "and")
- OR("Motilium", "Prandase", "Victoza", "Byetta", "Symlin")
- OR("Metformin", "DPP-4 inhibitors", "SGLT-2 inhibitors")
- OR("Agents affecting gastric emptying", "oral anti-diabetic agents")